某 50 歲男性，過去並無特殊之疾病史及工作史。於 1995 年開始從事石棉暴露的工作，1998 年因胸痛、咳血被診斷為肺癌。你認為其肺癌與石棉暴露有無因果關係？
A. 有，因為石棉是致癌物
B. 有，合乎時序性原則
C. 無，不合乎時序性原則
D. 無，不合乎劑量－反應關係

正確答案：C. 無，不合乎時序性原則